History of rheumatoid arthritis

The above is a clinical trial exclusion criterion. Annotated with entity spans:
History of [Condition: rheumatoid arthritis]